Biliary obstructive symptoms or signs

The above is a clinical trial inclusion criterion. Annotated with entity spans:
[Condition: Biliary obstructive symptoms] or signs